關於性類固醇激素對子宮內膜作用之敘述，下列何者錯誤？
A. 雌激素會刺激子宮內膜基質細胞（stroma cells）的增生
B. 黃體素會抑制子宮內膜基質細胞（stroma cells）的增生
C. 雌激素會刺激子宮內膜中血管（blood vessels）與腺體（glands）的增生
D. 黃體素會抑制子宮內膜中血管（blood vessels）與腺體（glands）的增生

正確答案：D. 黃體素會抑制子宮內膜中血管（blood vessels）與腺體（glands）的增生